Los linfocitos TH17:
1. Son inducidos por IL-17.
2. Median reacciones alérgicas.
3. Cooperan con los TH1 en la inmunidad celular.
4. Producen TGF-beta de manera importante.

Respuesta correcta: 3. Cooperan con los TH1 en la inmunidad celular.